有關ketamine敘述何者正確？
A. 濫用者多半使用血管注射
B. Ketamine半衰期很長，作用於γ-aminobutyric acid（GABA）受體
C. Ketamine可能誘發精神病症狀，其症狀之表現類似思覺失調症（schizophrenia）
D. Ketamine中毒時呈現高血壓心悸、呼吸抑制而導致死亡

正確答案：C. Ketamine可能誘發精神病症狀，其症狀之表現類似思覺失調症（schizophrenia）